History of severe untreated asthma, anaphylactic reactions or severe urticaria and/or angioedema

The above is a clinical trial exclusion criterion. Annotated with entity spans:
History of [Qualifier: severe] [Qualifier: untreated] [Condition: asthma], [Condition: anaphylactic reactions] or [Qualifier: severe] [Condition: urticaria] and/or [Condition: angioedema]